2. Persistent hypotension at Screening.

The above is a clinical trial exclusion criterion. Annotated with entity spans:
[Parsing_Error: 2.] [Condition: Persistent hypotension] [Temporal: at Screening].